下列何者不是鼻竇炎併發海綿靜脈竇栓塞時，會產生的症狀？
A. 三叉神經症候
B. 怕光
C. 複視
D. 顏面神經麻痺

正確答案：D. 顏面神經麻痺